Clinical trial exclusion criterion:
Known or suspected disorders of immunoglobulin synthesis.

Entity relations:
- Has_qualifier("disorders of immunoglobulin synthesis", "Known")
- OR("Known", "suspected")